Cigarette smoker

The above is a clinical trial exclusion criterion. Annotated with entity spans:
[Observation: Cigarette smoker]